GOLD 1: FEV1=0.80 and FEV1/FVC < 0.70

The above is a clinical trial inclusion criterion. Annotated with entity spans:
[Measurement: GOLD] [Value: 1]: [Measurement: FEV1][Value: =0.80] and [Measurement: FEV1/FVC] [Value: < 0.70]